下列何者不是陣發性夜間血色素尿（paroxysmal nocturnal hemoglobinuria）的特徵？
A. Indirect hyperbilirubinemia
B. Extravascular hemolysis
C. Pig-A gene mutation
D. Deficiency of membrane CD55, CD59

正確答案：B. Extravascular hemolysis